Clinical trial exclusion criterion:
Coagulopathies (INR > 2, activated partial thromboplastin time - aPTT>44 sec);

Annotated entities:
- Condition: "Coagulopathies"
- Measurement: "INR"
- Value: "> 2"
- Measurement: "activated partial thromboplastin time - aPTT"
- Value: ">44 sec"